Clinical trial inclusion criterion:
No change in active cardiac medications for 4 weeks prior to randomization

Entity relations:
- Has_qualifier("cardiac medications", "change")
- Has_negation("change", "No")
- Has_index("for 4 weeks prior to randomization", "randomization")
- Has_temporal("cardiac medications", "for 4 weeks prior to randomization")